下列何種散瞳藥物的作用機轉是經由抑制 muscarinic receptor，且於屬於短效型，適合用於成人？
A. scopolamine
B. pilocarpine
C. tropicamide
D. atropine

正確答案：C. tropicamide